Any individual wearing a MedAlert bracelet indicating that he/she has formally opted out of the EvK Trial.

The above is a clinical trial exclusion criterion. Annotated with entity spans:
[Condition: Any individual wearing a MedAlert bracelet indicating that he/she has formally opted out of the EvK Trial].